What is Behçet's disease

Behçet's disease (BD) is a complex chronic relapsing inflammatory disorder of unknown etiology.